Clinical trial exclusion criterion:
History of a primary sleep disorder other than RLS that may significantly affect the symptoms of RLS.

Annotated entities:
- Condition: "primary sleep disorder"
- Negation: "other"
- Condition: "RLS"